What is the function of a protein degron?

The N-degron protein degradation strategy for investigating the function of essential genes We developed a dormant N-degron that can be attached to the N-terminus of a protein of interest. Upon expression of a site-specific protease, the dormant N-degron becomes deprotected.